Clinical trial exclusion criterion:
immunization with PPV23 within the last year

Annotated entities:
- Procedure: "immunization"
- Drug: "PPV23"
- Temporal: "within the last year"